Clinical trial inclusion criterion:
Patients must be able to take oral medication.

Annotated entities:
- Non-query-able: "Patients must be able to take oral medication"